一位 80 歲男性病人發生右側大腦枕葉中風（right occipital lobe infarction），最可能產生下列何種視野缺損？
A. 左側視野同側半盲伴隨黃斑分裂（left homonymous hemianopsia with macular splitting）
B. 右側視野同側半盲伴隨黃斑分裂（right homonymous hemianopsia with macular splitting）
C. 兩鼻側半盲（binasal hemianopsia）
D. 兩顳側半盲（bitemporal hemianopsia）

正確答案：A. 左側視野同側半盲伴隨黃斑分裂（left homonymous hemianopsia with macular splitting）